Clinical trial exclusion criterion:
8. Currently enrolled in an investigational drug or device study or have used an investigational drug or device within 30 days prior to Visit 1.

Entity relations:
- Has_index("within 30 days prior to Visit 1", "Visit 1")
- Has_temporal("investigational drug", "within 30 days prior to Visit 1")
- OR("investigational drug", "investigational device", "investigational drug", "investigational device")